Baseline LIC >7 mg/g dw (measured by MRI);

The above is a clinical trial inclusion criterion. Annotated with entity spans:
[Measurement: Baseline LIC] [Value: >7 mg/g] dw (measured by [Procedure: MRI]);